胸降主動脈損傷，胸部X-ray影像學徵象，下列何者較少見？
A. 主動脈邊界模糊（blurring of the aortic contour）
B. 氣管偏向左邊（tracheal shift to the left）
C. 血胸（hemothorax）
D. 縱隔腔寬度增加（widening of the mediastinum）

正確答案：B. 氣管偏向左邊（tracheal shift to the left）